Señale la respuesta correcta. La consecución de los objetivos de salud que conlleva el desarrollo de protocolos de actuación y programas de salud se enmarca en la planificación:
1. Estratégica.
2. Táctica.
3. Operativa.
4. De gestión.

Respuesta correcta: 3. Operativa.